Clinical trial inclusion criterion:
need mechanical ventilation for more than 2 days

Annotated entities:
- Procedure: "mechanical ventilation"
- Mood: "need"
- Multiplier: "for more than 2 days"